Clinical trial inclusion criterion:
Need for intravenous fluid therapy

Annotated entities:
- Mood: "Need for"
- Procedure: "intravenous fluid therapy"